Patients receiving supplement diets

The above is a clinical trial exclusion criterion. Annotated with entity spans:
[Undefined_semantics: Patients receiving supplement diets]